Clinical trial exclusion criterion:
current moderate or severe alcohol/drug use disorder or in the past 8 weeks

Annotated entities:
- Qualifier: "moderate"
- Qualifier: "severe"
- Condition: "alcohol use disorder"
- Condition: "drug use disorder"
- Temporal: "in the past 8 weeks"